Clinical trial exclusion criterion:
Has a diagnosis of immunodeficiency or is receiving systemic steroid therapy or any other form of immunosuppressive therapy within 7 days prior to the first dose of study medication

Annotated entities:
- Condition: "immunodeficiency"
- Procedure: "systemic steroid therapy"
- Procedure: "immunosuppressive therapy"
- Temporal: "within 7 days prior"
- Reference_point: "the first dose of study medication"